Patient still in an exclusion period following the participation in another clinical trial.

The above is a clinical trial exclusion criterion. Annotated with entity spans:
Patient [Temporal: still in an exclusion period following] the [Competing_trial: participation in another clinical trial].